Clinical trial inclusion criterion:
ages of 7 and 75 years

Entity relations:
- Has_value("ages", "7 and 75 years")